八十四歲的伍爺爺因突發頭痛及行動不便，被送至急診室，神經內科主治醫師認為是出血性中風，最合適的檢查為下列何者？
A. 血管攝影（angiogram）
B. 電腦斷層攝影（CT）
C. 核磁共振攝影（MRI）
D. transcranial doppler

正確答案：B. 電腦斷層攝影（CT）